Known or suspected sensitivity to Dexamethasone Acetate (DXA)

The above is a clinical trial exclusion criterion. Annotated with entity spans:
[Observation: Known] or [Observation: suspected] [Condition: sensitivity to Dexamethasone Acetate (DXA)]